40 歲男性發生急性智力障礙，最不可能的診斷是：
A. 阿茲海默症（Alzheimer disease）
B. 硬腦膜下血腫
C. 溫尼克氏腦病變（Wernicke's encephalopathy）
D. 憂鬱症

正確答案：A. 阿茲海默症（Alzheimer disease）